Clinical trial inclusion criterion:
Transfer of patient to Riley Hospital for Children prior to any abdominal surgery

Entity relations:
- Has_index("prior to any abdominal surgery", "any abdominal surgery")
- multi("any abdominal surgery", "abdominal surgery")
- AND("Transfer", "Riley Hospital for Children")
- Has_temporal("Transfer", "prior to any abdominal surgery")